Abnormal coagulation profile: INR > 2.5 and/or PTT > 80

The above is a clinical trial exclusion criterion. Annotated with entity spans:
[Condition: Abnormal coagulation profile]: [Measurement: INR] [Value: > 2.5] and/or [Measurement: PTT] [Value: > 80]